Clinical trial exclusion criterion:
Taking medicine within one month;

Entity relations:
- Has_temporal("medicine", "within one month")